Patients with documented gastrointestinal, cerebral, or other hemorrhage within 3 months of the operation;

The above is a clinical trial exclusion criterion. Annotated with entity spans:
Patients with documented [Condition: gastrointestinal], [Condition: cerebral], or other [Condition: hemorrhage] [Temporal: within 3 months of the operation];